¿Cuál es la característica de la estrategia de investigación cuasi-experimental que la diferencia de la estrategia experimental?:
1. Se estudian casos únicos o muy pequeños.
2. El estudio se realiza en contextos simulados.
3. No se realiza asignación aleatoria de los participantes a las distintas condiciones de estudio.
4. Se utilizan varias variables dependientes.
5. Se realiza con muestras de participantes obtenidas por muestreo probabilístico.

Respuesta correcta: 3. No se realiza asignación aleatoria de los participantes a las distintas condiciones de estudio.